Clinical trial exclusion criterion:
Chronic opioid consumption

Entity relations:
- Has_qualifier("opioid consumption", "Chronic")